Child Pugh score是用來評估肝硬化嚴重的方式，Child Pugh score的組成共有5個項目，這5個項目是：
A. Albumin, bilirubin, prothrombin time, ascites, encephalopathy
B. Albumin, bilirubin, ALT （Alanine Aminotransferase）, ascites, encephalopathy
C. Albumin, bilirubin, ALT （Alanine Aminotransferase）, prothrombin time, ascites
D. Albumin, bilirubin, prothrombin time, ALT （Alanine Aminotransferase）, encephalopathy

正確答案：A. Albumin, bilirubin, prothrombin time, ascites, encephalopathy